Clinical trial exclusion criterion:
Subjects who have been treated with clozapine or long-acting injectable antipsychotic drugs within 3 months prior to the screening.

Entity relations:
- Has_index("within 3 months prior to the screening", "the screening")
- Has_temporal("clozapine", "within 3 months prior to the screening")
- OR("clozapine", "long-acting injectable antipsychotic drugs")